下列有關頸椎脫位性骨折治療的敘述，何者錯誤？
A. 牽引的重量依不同的頸椎而有不同
B. 牽引後須密切觀察病人神經學症狀
C. 牽引後須追蹤病人的頸椎X-ray
D. 調整重量後若無神經學的改變，不須再追蹤頸椎X-ray

正確答案：D. 調整重量後若無神經學的改變，不須再追蹤頸椎X-ray